El modelo terapéutico que introduce el entrenamiento en mindfulness como parte de las estrategias terapéuticas a utilizar para los trastornos de la personalidad es:
1. La terapia dialéctica comportamental.
2. La terapia interpersonal.
3. La terapia de mentalización.
4. La terapia icónica.
5. La terapia cognitiva.

Respuesta correcta: 1. La terapia dialéctica comportamental.